Clinical trial exclusion criterion:
Concurrent medications that affect gastrointestinal motility

Entity relations:
- AND("medications", "gastrointestinal motility")